Clinical trial exclusion criteria:
PCOS or polycystic ovary on ultrasound scan.
Moderate or severe endometriosis.
Hydrosalpinx.
Uterine abnormalities or myoma.
Previous uterine surgery.

Annotated entities:
- Condition: "PCOS"
- Condition: "polycystic ovary"
- Procedure: "ultrasound scan"
- Qualifier: "Moderate"
- Qualifier: "severe"
- Condition: "endometriosis"
- Condition: "Hydrosalpinx"
- Condition: "Uterine abnormalities"
- Condition: "myoma"
- Procedure: "uterine surgery"
- Temporal: "Previous"